Exclusion criteria include patients following resuscitation from cardiac arrest who are treated on the cooling protocol

The above is a clinical trial exclusion criterion. Annotated with entity spans:
Exclusion criteria include patients following [Procedure: resuscitation from cardiac arrest] who are treated on the [Qualifier: cooling protocol]